Clinical trial inclusion criterion:
health status compatible with detention in police cells

Annotated entities:
- Value: "compatible with detention in police cells"
- Measurement: "health status"